下列那一項生物性危害之侵入方式，以食入途徑為主？
A. 疱疹病毒（Herpes virus）
B. 流感病毒（Influenza virus）
C. 分枝桿菌（Mycobacteria）
D. 腸病毒（Enterovirus）

正確答案：D. 腸病毒（Enterovirus）